Clinical trial exclusion criterion:
Clinically significant bronchiectasis

Annotated entities:
- Condition: "bronchiectasis"
- Qualifier: "Clinically significant"